Las nefropatías intersticiales crónicas afectan a las estructuras tubulares y al intersticio renal. Si analizamos los defectos funcionales que estas patologías pueden producir, NO esperaremos encontrarnos:
1. Isostenuria.
2. Alcalosis metabólica hipoclorémica.
3. Atrofia tubular y fibrosis intersticial en el estudio histológico renal.
4. Sedimento urinario normal o poco expresivo.
5. Proteinuria de cuantía menor de 2 gramos por día.

Respuesta correcta: 2. Alcalosis metabólica hipoclorémica.